¿Mediante qué procedimiento experimental podemos evaluar la memoria implícita?:
1. El priming de repetición.
2. La técnica del informe parcial.
3. La técnica del informe total.
4. El método de los ahorros.
5. El recuerdo libre.

Respuesta correcta: 1. El priming de repetición.